Subjects must weigh at least 110 pounds (50 kg), but not to present obesity (BMI < 32kg/m2).

The above is a clinical trial inclusion criterion. Annotated with entity spans:
Subjects must [Measurement: weigh] [Value: at least 110 pounds] (50 kg), but [Negation: not to present] [Condition: obesity] ([Measurement: BMI] [Value: < 32kg/m2]).